Significant preoperative pain requiring treatment with high doses of opioids (more than 6-8 Norco tablets or equivalence per day) or recent history of opioid abuse

The above is a clinical trial exclusion criterion. Annotated with entity spans:
[Qualifier: Significant] [Condition: preoperative pain] [Mood: requiring] treatment with [Multiplier: high doses] of [Drug: opioids] ([Multiplier: more than 6-8] [Drug: Norco tablets] or [Drug: equivalence] per day) or [Temporal: recent] [Temporal: history] of [Condition: opioid abuse]